有關單尾與雙尾假說檢定的敘述，下列何者正確？
A. 單尾與雙尾假說檢定的p值算法相同
B. 相對於雙尾假說檢定，單尾假說檢定比較不易拒絕虛無假說
C. 單尾與雙尾假說檢定的顯	水準（α）相同
D. 相對於雙尾假說檢定，單尾假說檢定比較常被使用

正確答案：C. 單尾與雙尾假說檢定的顯	水準（α）相同